refractory bradycardia < 60 bpm despite treatment

The above is a clinical trial exclusion criterion. Annotated with entity spans:
[Qualifier: refractory] [Condition: bradycardia] [Value: < 60 bpm] [Qualifier: despite treatment]